Women of childbearing age will be required to have a negative pregnancy test at enrollment and use birth control throughout the duration of treatment.

The above is a clinical trial inclusion criterion. Annotated with entity spans:
[Pregnancy_considerations: Women of childbearing age will be required to have a negative pregnancy test at enrollment and use birth control throughout the duration of treatment.]